Hombre de 65 años con antecedente de neoplasia de páncreas en curso de quimioterapia. Consulta en Urgencias por dolor y edema de todo el miembro inferior desde ingle. ¿Qué prueba diagnóstica es más coste-efectiva para confirmar la sospecha diagnóstica?
1. Dímero D.
2. Resonancia magnética.
3. Flebografía.
4. Ecografía doppler venosa.
5. TAC helicoidal.

Respuesta correcta: 4. Ecografía doppler venosa.